7. Maternal and fetal condition remain stable after hospitalization for 72 hours

The above is a clinical trial inclusion criterion. Annotated with entity spans:
[Parsing_Error: 7.] [Condition: Maternal] and [Condition: fetal condition] remain [Qualifier: stable] [Temporal: after hospitalization for 72 hours]